下列那一種胺基酸為腎上腺素（epinephrine）生合成的前驅物？
A. glycine
B. tryptophan
C. histidine
D. tyrosine

正確答案：D. tyrosine